Clinical trial inclusion criteria:
Kidney transplant recipients at Washington University/Barnes-Jewish Hospital
Experiencing GI toxicity from MPA as determined by the treating physician within 12 months post-renal transplant
On standard immunosuppression with tacrolimus and prednisone

Annotated entities:
- Procedure: "Kidney transplant"
- Visit: "Washington University/Barnes-Jewish Hospital"
- Procedure: "GI toxicity"
- Drug: "MPA"
- Procedure: "standard immunosuppression"
- Drug: "tacrolimus"
- Drug: "prednison"